Clinical trial inclusion criterion:
Diagnosis of epilepsy confirmed.

Annotated entities:
- Condition: "epilepsy"